Patient is a primary liver transplant recipient

The above is a clinical trial inclusion criterion. Annotated with entity spans:
Patient is a [Condition: primary liver transplant] [Person: recipient]